In the list of heart transplantation;

The above is a clinical trial exclusion criterion. Annotated with entity spans:
[Mood: In the list] of [Procedure: heart transplantation];